5. Subjects with clinically significant cardiovascular disease. This includes:

The above is a clinical trial exclusion criterion. Annotated with entity spans:
[Parsing_Error: 5.] Subjects with [Qualifier: clinically significant] [Condition: cardiovascular disease]. [Parsing_Error: This includes:]